heavy smokers (with a daily consumption >20 cigarettes)

The above is a clinical trial exclusion criterion. Annotated with entity spans:
[Qualifier: heavy] [Person: smokers] (with a [Multiplier: daily consumption >20] [Observation: cigarettes])